Capable of giving informed consent.

The above is a clinical trial inclusion criterion. Annotated with entity spans:
[Mood: Capable of giving] [Observation: informed consent].